La conducta de tomar un analgésico cuando tenemos dolor de cabeza es un comportamiento adquirido mediante un procedimiento de:
1. Reforzamiento positivo.
2. Reforzamiento negativo.
3. Reforzamiento diferencial de otras conductas.
4. Moldeamiento.

Respuesta correcta: 2. Reforzamiento negativo.